Clinical trial inclusion criterion:
Patient either: refuses surgical treatment OR is contraindicated for surgical treatment

Annotated entities:
- Condition: "refuses surgical treatment"
- Condition: "contraindicated for surgical treatment"